Clinical trial exclusion criterion:
Clinically significant abnormal 12-lead ECG findings;

Entity relations:
- Has_qualifier("findings", "abnormal")
- Has_qualifier("findings", "Clinically significant")
- AND("12-lead ECG", "findings")